Clinical trial inclusion criterion:
Ability to understand and the willingness to sign a written informed consent.

Entity relations:
- OR("Ability to understand a written informed consent", "willingness to sign a written informed consent")